Clinical trial exclusion criterion:
any history of stroke, transient ischemic attack (TIA), instable angina pectoris or myocardial infarction within last 3 months prior to baseline visit

Annotated entities:
- Condition: "stroke"
- Condition: "transient ischemic attack"
- Condition: "TIA"
- Condition: "angina pectoris"
- Qualifier: "instable"
- Condition: "myocardial infarction"
- Temporal: "last 3 months prior to baseline visit"
- Reference_point: "baseline visit"